Clinical trial exclusion criterion:
Subject with TBS in an actively infected field (Class III Contaminated or Class IV Dirty or Infected)

Annotated entities:
- Condition: "TBS"
- Qualifier: "Class III Contaminated"
- Qualifier: "Class IV Dirty or Infected"